Clinical trial inclusion criterion:
Adult (>18 years of age and older) patients who have or will have undergone surgical resection or biopsy of a supratentorial brain tumor and are able to consent for themselves.

Entity relations:
- Has_value("age", "and older >18 years")
- Subsumes("Adult", "age")
- Has_mood("surgical resection", "will have undergone")
- AND("surgical resection", "supratentorial brain tumor")
- OR("surgical resection", "biopsy")